aged between 20 and 80

The above is a clinical trial inclusion criterion. Annotated with entity spans:
[Person: aged] [Value: between 20 and 80]